下列那一條肌肉不屬於旋轉肌袖組織（rotator cuff）？
A. 嵴上肌（supraspinatus）
B. 小圓肌（teres minor）
C. 大圓肌（teres major）
D. 肩胛下肌（subscapularis）

正確答案：C. 大圓肌（teres major）